Bypass graft lesion

The above is a clinical trial exclusion criterion. Annotated with entity spans:
[Device: Bypass graft] [Condition: lesion]